Clinical trial inclusion criterion:
patients scheduled to undergo hip arthroplasty

Annotated entities:
- Procedure: "hip arthroplasty"
- Mood: "scheduled to undergo"